Mediante el Real Decreto 450/2005, de 22 de abril, se regulan:
1. Los Planes de Estudios de Diplomado en Enfermería.
2. Los mínimos de acreditación para la transformación de las Escuelas de ATS en Escuelas de Diplomado en Enfermería.
3. Las competencias profesionales de los Diplomados en Enfermería.
4. Los Títulos Propios de Enfermería Avanzada.
5. Las Especialidades de Enfermería.

Respuesta correcta: 5. Las Especialidades de Enfermería.